Clinical trial exclusion criterion:
Physical allergies or cultural objections to porcine products

Annotated entities:
- Non-query-able: "Physical allergies or cultural objections to porcine products"